Clinical trial inclusion criterion:
1. Subjects must have recurrent or persistent platinum-resistant epithelial ovarian, fallopian tube, or primary peritoneal carcinoma with measureable disease (as defined by RECIST 1.1.) after first or second line platinum-based chemotherapy, for which treatment with PLD is indicated. Platinum-based therapy is defined as treatment with carboplatin, cisplatin or another organoplatinum compound. Platinum-resistant is defined as having a platinum-free interval (PFI) of < 12 months after first- or second-line platinum-based chemotherapy, or having disease progression while receiving second-line platinum-based chemotherapy.

Entity relations:
- Has_qualifier("primary peritoneal carcinoma", "recurrent")
- Has_qualifier("primary peritoneal carcinoma", "platinum-resistant")
- Has_index("after first line platinum-based chemotherapy", "first line platinum-based chemotherapy")
- Has_index("after second line platinum-based chemotherapy", "second line platinum-based chemotherapy")
- Has_temporal("measureable disease", "after second line platinum-based chemotherapy")
- AND("primary peritoneal carcinoma", "measureable disease")
- Has_qualifier("treatment with PLD", "indicated")
- AND("primary peritoneal carcinoma", "treatment with PLD")
- Subsumes("Platinum-based therapy", "carboplatin")
- Has_index("< 12 months after first- or second-line platinum-based chemotherapy", "first- or second-line platinum-based chemotherapy")
- Has_temporal("platinum-free interval (PFI)", "< 12 months after first- or second-line platinum-based chemotherapy")
- Subsumes("Platinum-resistant", "platinum-free interval (PFI)")
- Has_index("after second line platinum-based chemotherapy", "first line platinum-based chemotherapy")
- OR("recurrent", "persistent")
- OR("primary peritoneal carcinoma", "carcinoma fallopian tube", "carcinoma epithelial ovarian")
- OR("after second line platinum-based chemotherapy", "after first line platinum-based chemotherapy")
- OR("carboplatin", "cisplatin", "another organoplatinum compound")
- OR("platinum-free interval (PFI)", "disease progression")